Clinical trial exclusion criterion:
Intracranial infection.

Annotated entities:
- Condition: "Intracranial infection"